5. Use of hormonal contraception (estrogen and progestin) within 3 months of study entry, or anticipated need to initiate estrogen-containing hormonal contraception during the study period

The above is a clinical trial exclusion criterion. Annotated with entity spans:
5. Use of [Procedure: hormonal contraception] ([Drug: estrogen] and [Drug: progestin]) [Temporal: within 3 months of study entry], or [Observation: anticipated need] to initiate [Procedure: estrogen-containing hormonal contraception] [Temporal: during the study period]